Clinical trial exclusion criterion:
2. Screening tools: TMS adult safety screening.

Annotated entities:
- Parsing_Error: "2."
- Procedure: "Screening"
- Procedure: "TMS adult safety screening"